Any patient who has been previously randomized in the EvK Trial.

The above is a clinical trial exclusion criterion. Annotated with entity spans:
Any patient who has been [Temporal: previously] [Procedure: randomized] in the EvK Trial.